Type 2 Diabetes

The above is a clinical trial inclusion criterion. Annotated with entity spans:
[Condition: Type 2 Diabetes]